Patients with biopsy-proven metastatic carcinoid tumors or other neuroendocrine tumors (Islet cell, Gastrinomas and VIPomas) with at least one measurable lesion (other than bone) that has either not been previously irradiated or if previously irradiated has demonstrated progression since the radiation therapy

The above is a clinical trial inclusion criterion. Annotated with entity spans:
Patients with [Procedure: biopsy]-[Value: proven] [Condition: metastatic carcinoid tumors] or [Condition: other neuroendocrine tumors] ([Condition: Islet cell], [Condition: Gastrinomas] and [Condition: VIPomas]) with at least one [Condition: measurable lesion] ([Negation: other than] [Qualifier: bone]) that has either [Negation: not been] previously [Procedure: irradiated] or if previously [Procedure: irradiated] has demonstrated [Observation: progression] [Temporal: since the radiation therapy]